Known hypersensitivity to any of the study drugs, including the excipients, or any drugs formulated in polysorbate 80.

The above is a clinical trial exclusion criterion. Annotated with entity spans:
Known [Condition: hypersensitivity] to any of the [Drug: study drugs], including the excipients, or any [Drug: drugs formulated in polysorbate 80].